一位 70 歲原本健康之糖尿病病患，發燒 2 天、右上腹疼痛、右眼發紅（診斷為 endophthalmitis），下列何者為最可能之診斷？
A. 十二指腸潰瘍
B. 急性胰臟炎
C. 心絞痛
D. 肝膿瘍

正確答案：D. 肝膿瘍